有關酒精戒斷下列何者錯誤？
A. 酒精戒斷會引起譫妄（delirium），但若其本身就已有身體疾病則較易引起譫妄
B. 酒精戒斷會引起攻擊，因此需盡快將患者約束在床上
C. 常須給benzodiazepine類藥物治療
D. 避免給抗精神病藥物（antipsychotics）

正確答案：B. 酒精戒斷會引起攻擊，因此需盡快將患者約束在床上